Clinical trial exclusion criterion:
1. For subjects in Cohort A: previous therapy for more than 48 hours with any parenteral antibiotic with activity against S. aureus within 72 hours of positive blood culture results.

Entity relations:
- Has_temporal("therapy", "previous")
- Has_temporal("therapy", "for more than 48 hours")
- Has_value("blood culture", "positive results")
- Has_index("within 72 hours of positive blood culture results", "positive blood culture results")
- AND("Cohort A", "therapy")
- AND("Cohort A", "parenteral antibiotic with activity against S. aureus")
- Has_qualifier("Cohort A", "with activity against S. aureus")
- Has_context("Cohort A", "S. aureus")
- Has_temporal("Cohort A", "within 72 hours of positive blood culture results")
- AND("Cohort A", "blood culture")
- Has_qualifier("Cohort A", "parenteral")